Acute liver failure

The above is a clinical trial exclusion criterion. Annotated with entity spans:
[Condition: Acute liver failure]